Clinical trial inclusion criterion:
Developed HBeAg seroconversion (HBeAg negative and ant-HBe negative) with undetectable HBV DNA by PCR based assay on NA treatment.

Entity relations:
- Subsumes("seroconversion", "HBeAg")
- AND("treatment", "NA")
- Has_value("HBV DNA", "undetectable")
- AND("PCR based assay", "HBV DNA")
- AND("PCR based assay", "treatment")
- Subsumes("seroconversion", "ant-HBe")
- OR("ant-HBe", "negative")
- OR("HBeAg", "negative")
- OR("HBeAg", "seroconversion")